Clinical trial exclusion criterion:
Peripheral neuropathy> 1 grade

Annotated entities:
- Condition: "Peripheral neuropathy"
- Qualifier: "> 1 grade"